Clinical trial exclusion criterion:
Creatinine clearance < 30 mL/min

Annotated entities:
- Measurement: "Creatinine clearance"
- Value: "< 30 mL/min"